Clinical trial exclusion criterion:
Subject has been diagnosed with rheumatoid arthritis or other autoimmune disease.

Annotated entities:
- Condition: "rheumatoid arthritis"
- Qualifier: "other"
- Condition: "autoimmune disease"